Clinical trial exclusion criterion:
Planned cardiac surgery or planned major non-cardiac surgery within the study period.

Entity relations:
- Has_negation("cardiac", "non")
- Has_qualifier("surgery", "cardiac")
- Has_qualifier("surgery", "major")
- Has_mood("surgery", "planned")
- Has_mood("cardiac surgery", "Planned")
- Has_temporal("planned", "within the study period")
- Has_index("within the study period", "study period")
- OR("cardiac surgery", "surgery")